Clinical trial inclusion criterion:
Severe or uncontrolled infection.

Annotated entities:
- Qualifier: "Severe"
- Qualifier: "uncontrolled"
- Condition: "infection"